Clinical trial inclusion criterion:
Age between 0 and 18 years

Entity relations:
- Has_value("Age", "between 0 and 18 years")